Hombre de 46 años usuario de drogas por vía parenteral que acude a urgencias presentando fiebre con escalofríos, confusión mental, mialgias difusas y dolor intenso en mano izquierda de 24 horas de evolución sin claros signos flogóticos locales. No refiere ningún antecedente traumático. A la exploración destaca: temperatura 38,9ºC, 120 latidos por minuto, frecuencia respiratoria 30/min, presión arterial 90/54 mm Hg. En la analítica destaca una leucocitosis con desviación izquierda (25.000 leucocitos/mm3, 80% neutrófilos); aumento de las cifras de creatinina (1,6 mg/dL) y de CK (138 U/L). De entre los siguientes, ¿cuál es el diagnóstico más probable?:
1. Fascitis necrotizante estreptocócica.
2. Gangrena por Clostridium spp.
3. Celulitis por micobacterias.
4. Erisipela.

Respuesta correcta: 1. Fascitis necrotizante estreptocócica.